5. Suffers from at least two of the symptoms in the GLIA™ Glaucoma Medication Ocular Side Effect Symptoms Questionnaire at a severity of 2 (moderate) or more.

The above is a clinical trial inclusion criterion. Annotated with entity spans:
[Parsing_Error: 5.] Suffers from [Multiplier: at least two] of the [Condition: symptoms] in the [Measurement: GLIA™ Glaucoma Medication Ocular Side Effect Symptoms Questionnaire] at a [Value: severity of 2] ([Value: moderate]) or more.